Clinical trial exclusion criterion:
Progressive, unstable or uncontrolled clinical conditions.

Entity relations:
- Has_qualifier("clinical conditions", "Progressive")
- OR("Progressive", "unstable", "uncontrolled")